¿Cuál de las siguientes opciones NO es un efecto de la insulina?:
1. Estimula la gluconeogénesis hepática.
2. Estimula la captación de glucosa a nivel del tejido adiposo blanco.
3. Estimula la lipogénesis a nivel del tejido adiposo blanco.
4. Estimula la glucogenogénesis en el músculo esquelético.
5. Estimula la captación de glucosa a nivel muscular.

Respuesta correcta: 1. Estimula la gluconeogénesis hepática.